What is the price of KYMRIAH treatment in 2019?

Kymriah, produced by Novartis has a price tag of US$475,000.